PSA = 20 ng/ml

The above is a clinical trial inclusion criterion. Annotated with entity spans:
[Measurement: PSA] [Value: = 20 ng/ml]